培養真菌常用何種培養基？
A. 巧克力培養基
B. 沙保羅氏（Sabouraud's）培養基
C. Thioglycollate 培養基
D. 血清培養基

正確答案：B. 沙保羅氏（Sabouraud's）培養基